Clinical trial inclusion criterion:
Currently taking 1 to 3 antiepileptic drugs.

Annotated entities:
- Drug: "antiepileptic drugs"
- Multiplier: "1 to 3"